下列有關生產的第一產程之敘述，何者錯誤？
A. 第一產程根據子宮頸的擴張情形可分為兩個時期：潛伏期（latent phase）和活化期（active phase）
B. 潛伏期開始於孕婦感覺到子宮規則收縮並伴隨著子宮頸逐漸擴張到 3-5 公分之間
C. 當子宮頸擴張到 2 公分就一定是進入活化期
D. 所謂的延遲性潛伏期（prolonged latent phase）是指潛伏期在初產婦超過 20 小時或是在多產婦超過 14 小時

正確答案：C. 當子宮頸擴張到 2 公分就一定是進入活化期